5. Clinically relevant laboratory abnormalities (e.g. Hgb<11g/dL, Hct<30g/dL, total cholesterol >240mg/dL, triglycerides >500mg/dL, fasting glucose >130mg/dL, liver function tests >2.5x upper limit of normal, baseline international normalized ratio >1.2)

The above is a clinical trial exclusion criterion. Annotated with entity spans:
[Parsing_Error: 5.] [Qualifier: Clinically relevant] [Condition: laboratory abnormalities] (e.g. [Measurement: Hgb][Value: <11g/dL], [Measurement: Hct][Value: <30g/dL], [Measurement: total cholesterol] [Value: >240mg/dL], [Measurement: triglycerides] [Value: >500mg/dL], [Measurement: fasting glucose] [Value: >130mg/dL], [Measurement: liver function tests] [Value: >2.5x upper limit of normal], [Temporal: baseline] [Measurement: international normalized ratio] [Value: >1.2])